一位 50 歲中年肥胖婦女有明顯的胃酸逆流和心灼熱現象，下列敘述何者錯誤？
A. 減肥有利症狀控制
B. 最好減少咖啡和酒的飲用
C. 服用 calcium channel blocker 會使症狀惡化
D. 最好在飯後 30 分鐘服用 proton pump inhibitor

正確答案：D. 最好在飯後 30 分鐘服用 proton pump inhibitor